What is the name of the stem loop present in the 3' end of genes encoding for selenoproteins?

SECIS (selenocysteine insertion sequence)